Clinical trial exclusion criterion:
patients with severe allergic constitution, or those who are allergic to or intolerant of drug composition in chemotherapy regimens; with other malignant tumors in the past 5 years;

Entity relations:
- Has_qualifier("allergic", "severe")
- AND("allergic", "chemotherapy regimens")
- Has_qualifier("malignant tumors", "other")
- Has_temporal("malignant tumors", "past 5 years")
- OR("allergic", "intolerant")
- OR("allergic", "allergic", "malignant tumors")